HbA1c 8.0 - 10.5 %

The above is a clinical trial inclusion criterion. Annotated with entity spans:
[Measurement: HbA1c] [Value: 8.0 - 10.5 %]